Clinical trial inclusion criterion:
Mechanical ventilation

Annotated entities:
- Procedure: "Mechanical ventilation"